Evidence of HCC

The above is a clinical trial exclusion criterion. Annotated with entity spans:
[Mood: Evidence] of [Condition: HCC]